Clinical trial exclusion criteria:
acute myocardial infarction, heart failure, neoplastic disease, chronic diseases that may affect the inflammatory profile both systemic and epicardial (cancer, chronic intestinal inflammation, hepatitis, AIDS); life expectancy < 6 months, previous CABG and/or other open heart surgery intervention, acute coronary syndrome

Annotated entities:
- Condition: "acute myocardial infarction"
- Condition: "heart failure"
- Condition: "neoplastic disease"
- Condition: "chronic diseases"
- Qualifier: "may affect the inflammatory profile"
- Qualifier: "systemic"
- Qualifier: "epicardial"
- Condition: "cancer"
- Condition: "chronic intestinal inflammation"
- Condition: "hepatitis"
- Condition: "AIDS"
- Observation: "life expectancy"
- Value: "< 6 months"
- Procedure: "CABG"
- Temporal: "previous"
- Procedure: "open heart surgery intervention"
- Condition: "acute coronary syndrome"
- Qualifier: "other"